Clinical trial exclusion criterion:
Patients who have received wide field radiotherapy ≤ 4 weeks or limited field radiation for palliation < 2 weeks prior to screening or who have not recovered adequately from side effects of such therapy.

Annotated entities:
- Procedure: "wide field radiotherapy"
- Temporal: "≤ 4 weeks"
- Procedure: "limited field radiation for palliation"
- Temporal: "< 2 weeks prior to screening"
- Reference_point: "screening"
- Condition: "recovered"
- Qualifier: "adequately"
- Negation: "not"
- Condition: "side effects of such therapy"
- Undefined_semantics: "side effects of such therapy"
- Procedure: "such therapy"